Ability to speak and understand English

The above is a clinical trial inclusion criterion. Annotated with entity spans:
[Observation: Ability to speak] and understand English